poor health due to a current or past significant disease state or congenital abnormality.

The above is a clinical trial exclusion criterion. Annotated with entity spans:
[Condition: poor health] due to a [Temporal: current] or [Temporal: past] [Condition: significant disease state] or [Condition: congenital abnormality].